Clinical trial exclusion criterion:
known or suspected hypersensitivity to empagliflozin, glimepiride, or any excipients; and / or known or suspected hypersensitivity to sulfonylureas, sulfonamides or SGLT2 inhibitors in general

Entity relations:
- AND("hypersensitivity", "sulfonylureas")
- AND("hypersensitivity", "empagliflozin")
- OR("sulfonylureas", "sulfonamides", "SGLT2 inhibitors")
- OR("empagliflozin", "glimepiride")
- OR("hypersensitivity", "hypersensitivity")